Clinical trial inclusion criteria:
age > 18 y.o.
American Society of Anesthesiologists Physical Status Classification (ASA) 1-2
signed informed consent form after reading the information about the study and talking with one of the investigators

Annotated entities:
- Person: "age"
- Value: "> 18 y.o"
- Measurement: "American Society of Anesthesiologists Physical Status Classification"
- Measurement: "ASA"
- Value: "1-2"
- Informed_consent: "signed informed consent form after reading the information about the study and talking with one of the investigators"